Clinical trial inclusion criterion:
Undergoing elective primary, resurfacing arthroplasty, revision, or second stage re-implantation total hip replacement;

Entity relations:
- Has_qualifier("total hip replacement", "primary")
- Has_qualifier("total hip replacement", "elective")
- OR("primary", "revision", "resurfacing arthroplasty", "second stage re-implantation")